下列何者出現於骨盆且直接源自腰神經叢（lumbar plexus）？
A. 臀上神經（superior gluteal nerve）
B. 至閉孔內肌之神經（nerve to obturator internus）
C. 閉孔神經（obturator nerve）
D. 骨盆內臟神經（pelvic splanchnic nerve）

正確答案：C. 閉孔神經（obturator nerve）